Which neuropsychiatric disorders are associated with 16p13.11 genomic copy number variants?

schizophrenia, autism, mental retardation, ADHD, epilepsy